¿Cuál de los siguientes virus se replica en el citoplasma?
1. Herpesvirus.
2. Parvovirus.
3. Poxvirus.
4. Adenovirus.

Respuesta correcta: 3. Poxvirus.